Clinical trial inclusion criterion:
Primary periampullary tumor

Annotated entities:
- Qualifier: "Primary"
- Condition: "periampullary tumor"